一位 78 歲攝護腺癌病人對荷爾蒙療法已無效且發生全身骨骼轉移，疼痛指數常在 7 分以上（0～10 分），該病人經評估後已不適合作化學治療及放射性療法，其疼痛已無法以一般止痛藥物控制，下列何者治療較恰當？
A. 每週靜脈注射雙磷酸鹽 zoledronate 及不定時使用短效嗎啡
B. 口服短效嗎啡，每 3～4 小時一次，調整劑量直到穩定後改為長效嗎啡
C. 當病人發生疼痛時給予適量短效嗎啡，待穩定後改為長效嗎啡
D. 直接給予長效嗎啡，避免影響患者睡眠

正確答案：B. 口服短效嗎啡，每 3～4 小時一次，調整劑量直到穩定後改為長效嗎啡